Clinical trial exclusion criterion:
Patients receiving supplement diets

Annotated entities:
- Undefined_semantics: "Patients receiving supplement diets"